Clinical trial exclusion criterion:
Any diagnosed cardiovascular, pulmonary, neurological, and/ or orthopedic conditions that would interfere with subject participation

Entity relations:
- Has_qualifier("cardiovascular conditions", "interfere with subject participation")
- OR("cardiovascular conditions", "pulmonary conditions", "neurological conditions", "orthopedic conditions")